Clinical trial exclusion criterion:
Except for serious complications (cardiovascular events and recent significant liver, kidney or lung disease within 3 months)

Annotated entities:
- Condition: "serious complications"
- Condition: "cardiovascular events"
- Condition: "disease liver"
- Condition: "disease kidney"
- Condition: "lung disease"
- Temporal: "within 3 months"
- Qualifier: "significant"